Females who have high response (estradiol at time of ovulation trigger is > 5000 pg/ml or more than 15 oocytes are retrieved)

The above is a clinical trial exclusion criterion. Annotated with entity spans:
[Person: Females] who have [Condition: high response] ([Measurement: estradiol] [Temporal: at time of ovulation trigger] is [Value: > 5000 pg/ml] or [Value: more than 15] [Measurement: oocytes] are retrieved)